下列有關真核細胞Ras蛋白質之敘述，何者錯誤？
A. 基因突變後容易致癌
B. Ras蛋白質經修飾後會結合至細胞膜上
C. Ras蛋白質利用其N端氨基與法尼基（farnesyl）之官能基結合
D. 修飾Ras蛋白質之法尼基（farnesyl）之官能基的合成和膽固醇（cholesterol）的合成使用同一前驅物

正確答案：C. Ras蛋白質利用其N端氨基與法尼基（farnesyl）之官能基結合